Clinical trial exclusion criterion:
Steroid therapy

Annotated entities:
- Drug: "Steroid therapy"